Clinical trial inclusion criterion:
ischemic cardiomyopathy with or without previous myocardial infarction or

Annotated entities:
- Condition: "ischemic cardiomyopathy"
- Condition: "myocardial infarction"
- Temporal: "previous"